Total RLS severity score of 15 or greater on the IRLS rating scale at Visit 1 (screening) and at Visit 2 (baseline) (Appendix 8).

The above is a clinical trial inclusion criterion. Annotated with entity spans:
[Measurement: Total RLS severity score] of [Value: 15 or greater] on the IRLS rating scale at Visit 1 (screening) and at Visit 2 (baseline) (Appendix 8).